Clinical trial exclusion criterion:
Severe renal dysfunction (eGFR=30 ml/min/1.73m2).

Annotated entities:
- Condition: "renal dysfunction"
- Qualifier: "Severe"
- Measurement: "eGFR"
- Value: "=30 ml/min/1.73m2"